Current use of opioid drugs

The above is a clinical trial exclusion criterion. Annotated with entity spans:
Current use of [Drug: opioid] drugs